Clinical trial inclusion criteria:
Patients between 3 to 16 years of age undergoing adenotonsillectomy, with or without myringotomy or myringoplasty
ASA 1 & 2

Annotated entities:
- Value: "between 3 to 16 years"
- Person: "age"
- Procedure: "adenotonsillectomy"
- Temporal: "undergoing"
- Procedure: "myringotomy"
- Procedure: "myringoplasty"
- Measurement: "ASA"
- Value: "1 & 2"